Currently taking an antidepressant, mood stabiliser, antipsychotic, anticonvulsant, warfarin or thyroxin, or current regular use (more than 2 days per week) of a benzodiazepine or opioid-based analgesic

The above is a clinical trial inclusion criterion. Annotated with entity spans:
[Temporal: Currently] [Condition: taking] an [Drug: antidepressant], [Drug: mood stabiliser], [Drug: antipsychotic], [Drug: anticonvulsant], [Drug: warfarin] or [Drug: thyroxin], or [Temporal: current] [Multiplier: regular] [Procedure: use] ([Multiplier: more than 2 days per week]) of a [Drug: benzodiazepine] or [Drug: opioid-based analgesic]